下列關於guanylyl cyclase的敘述，何者正確？
A. guanylyl cyclase主要功能是使cyclic GMP（cGMP）轉變為5'-GMP
B. guanylyl cyclase是細胞膜上的受體（receptor），皆為穿透性蛋白質（integral protein）
C. guanylin可結合在小腸上之guanylyl cyclase receptor，進而調控小腸內Cl-離子分泌
D. 用來治療陽痿之藍色藥丸Viagra其主要藥物作用是促進cyclic GMP（cGMP）的產生

正確答案：C. guanylin可結合在小腸上之guanylyl cyclase receptor，進而調控小腸內Cl-離子分泌